Un niño de 16 meses decía “papa” (patata) para referirse a cualquier fruta o verdura redonda ¿Cómo se denomina esta aplicación de una palabra a mas objetos de los que incluye su significado convencional?:
1. Restricción semántica.
2. Aliteración semántica.
3. Infraexclusividad semántica.
4. Sobreextensión semántica.

Respuesta correcta: 4. Sobreextensión semántica.